Clinical trial exclusion criterion:
A previous adequate trial of topiramate

Annotated entities:
- Drug: "topiramate"
- Temporal: "previous"